下列有關急性肝衰竭病人重症照顧處置之敘述，何者錯誤？
A. 歐美國家最常見病因為acetaminophen引發肝毒性
B. 預防性抗生素已證明可有效減低感染率
C. 腦水腫與腦壓增高，是不良預後的指標
D. 高血鈉（>150 mmol/L）列為換肝之禁忌

正確答案：D. 高血鈉（>150 mmol/L）列為換肝之禁忌